Clinical trial exclusion criterion:
Known hypersensitivity to rifampin or rifabutin.

Annotated entities:
- Condition: "hypersensitivity"
- Drug: "rifampin"
- Drug: "rifabutin"